下列關於癲癇失神型小發作（absence, petit mal）的敘述，何者最正確？
A. 首次發作通常發生於 15 歲到 20 歲之間
B. 發作中不會有自動症（automatism）
C. 發作時腦電圖（EEG）呈現局部性棘波（focal spikes）
D. 過度換氣（hyperventilation）會引起發作

正確答案：D. 過度換氣（hyperventilation）會引起發作